Clinical trial inclusion criterion:
laparoscopic roux-en-y gastric bypass

Entity relations:
- Has_qualifier("roux-en-y gastric bypass", "laparoscopic")